Severe systematic disorder

The above is a clinical trial exclusion criterion. Annotated with entity spans:
[Condition: Severe systematic disorder]